Diagnosis: Major depression, unipolar (by Structured Clinical Interview for Diagnostic and Statistical Manual (DSM)IV (SCID-R) and DSM-IV criteria);

The above is a clinical trial inclusion criterion. Annotated with entity spans:
Diagnosis: [Condition: Major depression], [Qualifier: unipolar] (by Structured Clinical Interview for Diagnostic and Statistical Manual ([Measurement: DSM])[Measurement: IV] ([Measurement: SCID]-R) and [Measurement: DSM-IV criteria)];